Pregnant or breast-feeding women.

The above is a clinical trial exclusion criterion. Annotated with entity spans:
[Condition: Pregnant] or [Condition: breast-feeding] [Person: women].